下列有關二尖瓣脫垂的敍述，何者錯誤？
A. 常見的病理變化為瓣膜呈現myxomatous change，好發於後葉瓣膜
B. 好發於Marfan syndrome病患
C. 好發於15～30歲的男性
D. 大部分病人臨床無特別症狀，無須特別治療

正確答案：C. 好發於15～30歲的男性